Signs of myocardial injury as indicated by elevated troponin levels

The above is a clinical trial inclusion criterion. Annotated with entity spans:
Signs of [Condition: myocardial injury] as indicated by [Value: elevated] [Measurement: troponin levels]